Clinical trial exclusion criteria:
patients' refusal
contraindication to regional anaesthesia (coagulopathies, concurrent anticoagulant therapy, allergy to local anaesthetics, infection at puncture site)

Annotated entities:
- Post-eligibility: "patients' refusal"
- Condition: "contraindication"
- Procedure: "regional anaesthesia ("
- Condition: "coagulopathies"
- Drug: "anticoagulant therapy"
- Condition: "allergy"
- Procedure: "local anaesthetics"
- Condition: "infection"
- Qualifier: "puncture site"